other new standards of exclusion criteria for first needle

The above is a clinical trial exclusion criterion. Annotated with entity spans:
[Non-query-able: other new standards of exclusion criteria for first needle]